下列何種藥物可以用來治療子宮內膜異位症（endometriosis）的不正常疼痛現象？
A. leuprolide
B. ganirelix
C. desmopressin
D. conivaptan

正確答案：A. leuprolide